Los pacientes intervenidos de cirugía gástrica requieren tratamiento de sustitución de vitamina B12 por:
1. Déficit de CLH- que dificulta la absorción de los nutrientes.
2. Excesiva pérdida de esta vitamina por las heces.
3. Escasa ingesta de alimentos a consecuencia de la anorexia.
4. Deficiencia en su absorción por falta de factor intrínseco.
5. Excesiva pérdida de esta vitamina por la orina.

Respuesta correcta: 4. Deficiencia en su absorción por falta de factor intrínseco.